De entre las siguientes, indicar la sustancia más tóxica según el valor de dosis letal 50:
1. Estricnina.
2. Nicotina.
3. Morfina.
4. Toxina botulínica.
5. Curare.

Respuesta correcta: 4. Toxina botulínica.